Clinical trial exclusion criterion:
Medical or anatomic contraindication to supraclavicular blockade as judged by clinician

Entity relations:
- Has_qualifier("contraindication", "Medical")
- AND("contraindication", "supraclavicular blockade")
- OR("Medical", "anatomic")